Clinical trial exclusion criterion:
Uncorrected obstructive or severe regurgitant valve disease, nondilated cardiomyopathy, or significant systemic ventricular outflow obstruction

Annotated entities:
- Qualifier: "Uncorrected"
- Condition: "obstructive valve disease"
- Qualifier: "severe"
- Condition: "regurgitant valve disease"
- Condition: "nondilated cardiomyopathy"
- Qualifier: "significant"
- Condition: "systemic ventricular outflow obstruction"